Clinical trial inclusion criterion:
Patients' CMV-DNA = 1000cp/ml in treatment group and being negative in prophylactic group.

Annotated entities:
- Measurement: "CMV-DNA"
- Value: "= 1000cp/ml"
- Person: "treatment group"
- Person: "prophylactic group"
- Value: "negative"